Clinical trial exclusion criterion:
Patients not suffering from endometrial or epithelial ovarian cancer

Annotated entities:
- Condition: "epithelial ovarian cancer"
- Condition: "endometrial ovarian cancer"
- Negation: "not"